Subject must be able to change to Salbutamol/Albuterol MDI rescue for the duration of the study and judged capable of withholding albuterol/salbutamol for at least 6 hours prior to study visits.

The above is a clinical trial inclusion criterion. Annotated with entity spans:
Subject must be [Mood: able to] [Procedure: change] to [Drug: Salbutamol]/[Drug: Albuterol] [Procedure: MDI rescue] [Temporal: for the duration of the study] and judged [Condition: capable of withholding] [Drug: albuterol]/[Drug: salbutamol] [Multiplier: for at least 6 hours] [Temporal: prior to study visits].